Clinical trial exclusion criterion:
Unstable pulmonary embolism, deep vein thrombosis, or other significant arterial/venous thromboembolic event <=30 days before first dose of study treatment. If on anticoagulation, subject must be on stable therapeutic dose prior to first dose of study treatment.

Annotated entities:
- Qualifier: "Unstable"
- Condition: "pulmonary embolism"
- Condition: "deep vein thrombosis"
- Qualifier: "other"
- Qualifier: "significant"
- Condition: "arterial thromboembolic event"
- Condition: "venous thromboembolic event"
- Temporal: "<=30 days before first dose of study treatment"
- Reference_point: "first dose of study treatment"
- Procedure: "anticoagulation"
- Qualifier: "stable"
- Multiplier: "therapeutic dose"
- Temporal: "prior to first dose of study treatment"
- Reference_point: "first dose of study treatment"